Clinical trial exclusion criterion:
Patients with Acute Myocardial Infarction (ST elevation myocardial infarction, Non ST elevation myocardial infarction)

Entity relations:
- Subsumes("Acute Myocardial Infarction", "ST elevation myocardial infarction")
- OR("ST elevation myocardial infarction", "Non ST elevation myocardial infarction")